患者因長期居住於高噪音的工業區，右耳喪失高音頻聽覺，其可能病因為：
A. 位於 cochlea 基部（base）之 organ of Corti 受損
B. 位於 cochlea 頂部（apex）之 organ of Corti 受損
C. 右側 primary auditory cortex 受損
D. 右側 cochlear nerve 完全切斷

正確答案：A. 位於 cochlea 基部（base）之 organ of Corti 受損